Clinical trial exclusion criterion:
High-dose statin load <24 hours prior to procedure

Annotated entities:
- Drug: "High-dose statin"
- Temporal: "<24 hours prior to procedure"
- Reference_point: "procedure"